Standard-risk (SR) group meeting all of the following criteria:

The above is a clinical trial inclusion criterion. Annotated with entity spans:
[Line: Standard-risk (SR) group meeting all of the following criteria]: